Clinical trial exclusion criterion:
Significant renal dysfunction (Serum creatinine > 2.0 mg/dl

Entity relations:
- Has_qualifier("renal dysfunction", "Significant")
- Has_value("Serum creatinine", "> 2.0 mg/dl")
- Subsumes("Significant", "Serum creatinine")